引起高陰離子間隙代謝性酸中毒（High anion gap metabolic acidosis）的疾病，下列何者最為罕見？
A. 糖尿病引起酮酸血症 （Diabetic ketoacidosis, DKA）
B. 因休克引起的乳酸中毒（Sepsis induced lactic acidosis）
C. 腎小管酸血症（Renal tubular acidosis）
D. 乙二醇中毒（Ethylene glycol intoxication）

正確答案：C. 腎小管酸血症（Renal tubular acidosis）